Clinical trial inclusion criterion:
Patients concurrently treated with oral 5-aminosalicylates or corticosteroids were to receive a stable dose for at least 2 weeks before baseline, and patients receiving AZA and/or 6MP were to receive a stable dose for at least 4 weeks before baseline. Patients were required to maintain stable doses of their concomitant UC medications during the study.

Annotated entities:
- Drug: "oral 5-aminosalicylates"
- Drug: "corticosteroids"
- Qualifier: "stable dose"
- Temporal: "for at least 2 weeks before baseline"
- Drug: "AZA"
- Drug: "6MP"
- Qualifier: "stable dose"
- Temporal: "for at least 4 weeks before baseline"
- Procedure: "treated"
- Non-representable: "Patients were required to maintain stable doses of their concomitant UC medications during the study."